下列何種物質，對血液中酸鹼值調控的重要性最低？
A. 蛋白質
B. 硫酸氫根
C. 碳酸氫根
D. 血紅素

正確答案：B. 硫酸氫根